維生素A（vitamin A）會與細胞中下列那一類蛋白質直接結合，以調控基因表達？
A. calcitriol receptor
B. receptor tyrosine kinases
C. nuclear retinoid receptors
D. G protein-coupled receptors

正確答案：C. nuclear retinoid receptors